¿A qué tipo de agentes pertenece el óxido de etileno?
1. Esterilizantes.
2. Desinfectantes.
3. Antisépticos.
4. De acción oligodinámica.

Respuesta correcta: 1. Esterilizantes.